Clinical trial inclusion criterion:
Adult patients (older than 18 years of age), male and female, with chronic non-cancer and cancer pain (at least 3 months in duration)

Annotated entities:
- Person: "Adult"
- Value: "older than 18 years"
- Person: "age"
- Person: "male"
- Person: "female"
- Qualifier: "chronic"
- Qualifier: "non-cancer"
- Qualifier: "cancer"
- Condition: "pain"
- Multiplier: "at least 3 months in duration"